65歲女性，過去僅有糖尿病的病史，第一次被診斷為高血壓，因為收縮壓在190～200 mmHg之間，由門診轉到急診，沒有任何不舒服，過去病人不知道自己有高血壓，下列何者處理欠佳？
A. 請病人稍作休息，再量一次血壓
B. 詢問過去病史及家族病史
C. 馬上給予舌下短效nifedipine降壓
D. 注意有無神經學的變化

正確答案：C. 馬上給予舌下短效nifedipine降壓